Clinical trial exclusion criterion:
severe underlying illness, such as end stage renal disease, decompensated liver cirrhosis, or non-curative malignancy

Entity relations:
- Has_qualifier("liver cirrhosis", "decompensated")
- Has_qualifier("malignancy", "non-curative")
- Subsumes("severe underlying illness", "end stage renal disease")
- OR("end stage renal disease", "liver cirrhosis", "malignancy")